下列何種憂鬱症病人的特徵或伴隨症狀，最不會在之後病程中，轉變成雙極性疾患（bipolar disorder）？
A. 發病時間早
B. 症狀產生的時間慢且維持時間長
C. 25 歲之前伴隨有妄想（delusions）
D. 25 歲之前伴隨有幻覺（hallucinations）

正確答案：B. 症狀產生的時間慢且維持時間長